Clinical trial inclusion criterion:
Eligible for heat treatment

Annotated entities:
- Mood: "Eligible for"
- Procedure: "heat treatment"